Smoke at least 10 cigarettes daily

The above is a clinical trial inclusion criterion. Annotated with entity spans:
[Observation: Smoke] [Value: at least 10 cigarettes daily]